右大腿截肢的患者穿戴膝上型義肢走路時，如果義肢太短，將會產生下列那一種狀況？
A. 身體往左側傾斜（left side trunk bending）
B. 身體往右側傾斜（right side trunk bending）
C. 義肢發生外展步態（abduction gait）
D. 義肢發生迴轉步態（circumduction gait）

正確答案：B. 身體往右側傾斜（right side trunk bending）